The formation of which inflammatory molecule is regulated by MAP3K8 (TPL2)?

MAP3K8 is involved in local adipose tissue inflammation, specifically for IL-1β and its responsive cytokines IL-6 and IL-8, but does not seem to have systemic effects on insulin resistance.